Clinical trial exclusion criterion:
Patients who have received a live vaccine within 30 days prior to the first dose of trial treatment.

Entity relations:
- Has_index("within 30 days prior to the first dose of trial treatment", "the first dose of trial treatment")
- Has_temporal("live vaccine", "within 30 days prior to the first dose of trial treatment")